Currently pregnant or breastfeeding

The above is a clinical trial exclusion criterion. Annotated with entity spans:
[Temporal: Currently] [Condition: pregnant] or [Observation: breastfeeding]